Clinical trial inclusion criterion:
Histologically or cytologically confirmed adenocarcinoma of the breast with locally advanced or metastatic disease, and a candidate for chemotherapy.

Entity relations:
- multi("candidate for chemotherapy", "chemotherapy")
- AND("adenocarcinoma of the breast", "disease locally advanced")
- AND("adenocarcinoma of the breast", "metastatic disease")
- Has_qualifier("adenocarcinoma of the breast", "Histologically confirmed")
- AND("adenocarcinoma of the breast", "candidate for chemotherapy")
- OR("Histologically confirmed", "cytologically confirmed")